Clinical trial exclusion criterion:
11. Major surgery within 4 weeks prior to enrollment in the study

Annotated entities:
- Procedure: "Major surgery"
- Temporal: "within 4 weeks prior to enrollment"
- Reference_point: "enrollment"